Clinical trial inclusion criterion:
treatment with dual antiplatelet therapy (clopidogrel and acetylsalicylic acid) between left atrial appendage closure and randomization

Entity relations:
- AND("dual antiplatelet therapy", "clopidogrel")
- multi("left atrial appendage closure", "left atrial appendage closure")
- AND("between left atrial appendage closure and randomization", "left atrial appendage closure")
- Has_index("between left atrial appendage closure and randomization", "randomization")
- Has_index("between left atrial appendage closure and randomization", "left atrial appendage closure")
- AND("dual antiplatelet therapy", "acetylsalicylic acid")
- AND("left atrial appendage closure", "randomization")
- AND("left atrial appendage closure", "left atrial appendage closure")